Clinical trial inclusion criterion:
Failure of index PCI

Entity relations:
- Has_temporal("PCI", "index")
- Has_context("PCI", "Failure")